Drug and alcohol abuse

The above is a clinical trial exclusion criterion. Annotated with entity spans:
[Condition: Drug] and [Condition: alcohol abuse]